Clinical trial inclusion criterion:
For patients >= 40 years of age: any one of the following:

Annotated entities:
- Value: ">= 40 years"
- Person: "age"